Clinical trial inclusion criteria:
All adult patients 18 years of age or older admitted to the intensive care units of St. Boniface General Hospital with a diagnosis of acute pulmonary blastomycosis requiring mechanical ventilation.

Annotated entities:
- Person: "adult"
- Value: "18 years or older"
- Person: "age"
- Visit: "intensive care units"
- Visit: "St. Boniface General Hospital"
- Procedure: "admitted"
- Condition: "acute pulmonary blastomycosis"
- Procedure: "mechanical ventilation"